Clinical trial exclusion criterion:
Any confirmed or suspected immunosuppressive or immunodeficient condition, including HIV infection;

Annotated entities:
- Condition: "immunosuppressive condition"
- Condition: "immunodeficient condition"
- Condition: "HIV infection"